Clinical trial exclusion criterion:
15. Women who are pregnant, lactating, or unwilling to use contraception if of childbearing potential

Annotated entities:
- Condition: "pregnant"
- Condition: "lactating"
- Mood: "unwilling"
- Condition: "childbearing potential"
- Condition: "contraception"